以凝膠電泳法（gel electrophoresis）分離蛋白質時，加入SDS（sodium dodecyl sulfate）的目的為何？
A. 用以決定一個蛋白質的等電點（isoelectric point）
B. 用以決定一個蛋白質的特異活性（specific activity）
C. 用以保護蛋白質的生物結構和活性
D. 用以決定蛋白質分子量

正確答案：D. 用以決定蛋白質分子量